下列那一種成熟的血球細胞沒有表現第一型主要組織相容性複合體（MHC class I）分子？
A. B 細胞
B. 紅血球
C. T 細胞
D. 巨噬細胞

正確答案：B. 紅血球